Clinical trial exclusion criterion:
History of seizures (this criterion does not apply to subjects who have had a single, uncomplicated febrile convulsion in the past) or neurological disease.

Entity relations:
- Has_qualifier("febrile convulsion", "uncomplicated")
- Has_multiplier("febrile convulsion", "single")
- Has_negation("febrile convulsion", "does not apply")
- AND("seizures", "febrile convulsion")
- Has_temporal("seizures", "History")
- OR("seizures", "neurological disease")